Los cinco superfactores del Modelo de personalidad de los Cinco Grandes surgen de:
1. Un enfoque teórico apriorístico, como en el modelo de tres factores de H.J. Eysenck.
2. Un enfoque léxico, como en el caso del modelo de R.B. Cattell.
3. La combinación de una aproximación factorial, en primer lugar, seguida de una léxica.
4. La combinación de una aproximación léxica, en primer lugar, seguida de una factorial.

Respuesta correcta: 4. La combinación de una aproximación léxica, en primer lugar, seguida de una factorial.